En los estudios que emplean el metaanálisis para la revisión sistemática de los resultados de las psicoterapias ¿cuál es la variable dependiente más utilizada? :
1. El número de síntomas depresivos.
2. El tamaño del efecto.
3. La observación sistematizada del terapeuta.
4. El número de pacientes que se ha curado.
5. Las expectativas del paciente.

Respuesta correcta: 2. El tamaño del efecto.